Subjects with hemoglobin SC or SB+ thalassemia

The above is a clinical trial exclusion criterion. Annotated with entity spans:
Subjects with [Condition: hemoglobin SC] or [Condition: SB+ thalassemia]